Clinical trial exclusion criterion:
HBsAg positive or HBcAb negative or hepatitis B virus DNA positive at baseline

Entity relations:
- Has_temporal("HBsAg positive", "at baseline")
- OR("HBsAg positive", "hepatitis B virus DNA positive", "HBcAb negative")